目前臺灣婦女子宮頸感染人類乳突病毒（HPV）的盛行率（prevalence）約為多少？
A. 15%
B. 35%
C. 50%
D. 75%

正確答案：A. 15%